Clinical trial exclusion criterion:
History of atypical cholinesterase (CP is metabolized by cholinesterase)

Entity relations:
- Has_temporal("atypical cholinesterase", "History")